Clinical trial exclusion criterion:
ventral hernia repair

Annotated entities:
- Condition: "ventral hernia"
- Procedure: "repair"